Clinical trial exclusion criterion:
Surgical Closure of abdominal wall defect with prosthetic material (e.g. prosthetic or bio-prosthetic mesh)

Annotated entities:
- Procedure: "Surgical Closure"
- Condition: "abdominal wall defect"
- Device: "prosthetic material"
- Device: "prosthetic mesh"
- Device: "bio-prosthetic mesh"